Clinical trial exclusion criterion:
Presence of clinical contraindications for treatment with MTX

Annotated entities:
- Undefined_semantics: "Presence of clinical contraindications for treatment with MTX"